精子頭部的尖體（acrosome）的功能為：
A. 擺動前進
B. 產生能量物質 ATP
C. 攜帶遺傳物質 DNA
D. 釋放酵素穿透卵的細胞膜

正確答案：D. 釋放酵素穿透卵的細胞膜